下列那一種病原最不常發生母子之間的垂直感染？
A. Cytomegalovirus
B. Syphilis
C. Rubella
D. Epstein-Barr virus

正確答案：D. Epstein-Barr virus